Clinical trial exclusion criterion:
Anemia (hematocrit < 34%) as measured at screening visit

Annotated entities:
- Condition: "Anemia"
- Measurement: "hematocrit"
- Value: "< 34%"
- Visit: "screening visit"